Clinical trial exclusion criterion:
Severe hepatic dysfunction (> 3 times normal reference values)

Annotated entities:
- Qualifier: "Severe"
- Condition: "hepatic dysfunction"
- Non-representable: "(> 3 times normal reference values)"